Clinical trial inclusion criterion:
Patients on Sandostatin Lar (long acting somatostatin analogue) must be on a stable dose for 30 days prior to study entry and short acting somatostatin analogues must be judged to be on a clinically stable dose by the investigator prior to study entry

Annotated entities:
- Drug: "Sandostatin Lar"
- Drug: "long acting somatostatin analogue"
- Qualifier: "stable dose"
- Temporal: "for 30 days prior to study entry"
- Drug: "short acting somatostatin analogues"
- Qualifier: "clinically stable dose"
- Temporal: "prior to study entry"